以下何者不是造成肺部嗜酸性白血球增多的原因？
A. 過敏性麴菌感染
B. 藥物反應
C. 寄生蟲感染
D. 病毒感染

正確答案：D. 病毒感染